Clinical trial inclusion criterion:
Able to meet the extensive post-op evaluation regimen.

Annotated entities:
- Post-eligibility: "Able to meet the extensive post-op evaluation regimen."